Clinical trial inclusion criterion:
Previously treated patients, with failure or intolerance to first-line therapy, or relapse after first-line therapy, i.e. corticosteroids, intravenous immunoglobulin (IVIG), or anti-D immunoglobulins

Entity relations:
- Has_qualifier("first-line therapy", "intolerance")
- Has_qualifier("first-line therapy", "failure")
- multi("first-line therapy", "first-line therapy")
- Has_index("after first-line therapy", "first-line therapy")
- Has_temporal("relapse", "after first-line therapy")
- Subsumes("intravenous immunoglobulin", "IVIG")
- OR("first-line therapy", "relapse")
- OR("corticosteroids", "intravenous immunoglobulin", "anti-D immunoglobulins")